Age = 18 years of either gender

The above is a clinical trial inclusion criterion. Annotated with entity spans:
[Person: Age] [Value: = 18 years] of [Person: either gender]